Which tool has been developed for annotation of Gα, Gβ and Gγ subunits of G-proteins?

GprotPRED is a tool that has been developed for annotation of Gα, Gβ and Gγ subunits of G-proteins using profile Hidden Markov Models (pHMMs).